Clinical trial exclusion criterion:
Patients previously enrolled in this trial

Annotated entities:
- Observation: "previously enrolled in this trial"